Clinical trial inclusion criterion:
Positive HBeAg before starting NA treatment

Entity relations:
- Has_value("HBeAg", "Positive")
- Has_index("before starting NA treatment", "starting NA treatment")
- Has_temporal("HBeAg", "before starting NA treatment")